正常情況下，下列那一段腎小管不能主動重吸收鈉離子？
A. 近側腎曲小管
B. 亨利氏彎管下行支
C. 遠側腎曲小管
D. 皮質收集管

正確答案：B. 亨利氏彎管下行支